Clinical trial exclusion criterion:
a-D-mannose intake within the last month

Annotated entities:
- Drug: "a-D-mannose"
- Temporal: "within the last month"